對於食道憩室（esophageal diverticula）最好的診斷工具為下列何者？
A. 胸部電腦斷層掃描
B. 胸部核磁共振造影（MRI）
C. 食道鋇劑攝影（barium esophagram）
D. 胃鏡檢查

正確答案：C. 食道鋇劑攝影（barium esophagram）